Clinical trial exclusion criterion:
With severe cardio-pulmonary dysfunction, such as left heart failure, unstable arrhythmia, etc.

Entity relations:
- Has_qualifier("cardio-pulmonary dysfunction", "severe")
- Has_qualifier("arrhythmia", "unstable")
- Subsumes("cardio-pulmonary dysfunction", "left heart failure")
- OR("left heart failure", "arrhythmia")